Documentation of a CF diagnosis

The above is a clinical trial inclusion criterion. Annotated with entity spans:
Documentation of a [Condition: CF] diagnosis